一位 18 歲男性，除了小時候曾有氣喘病史外，健康狀況良好。在大學新生體檢時做全血球檢查顯示血紅素為 12.8 gm/dL，紅血球數 5.6×106/µL，平均紅血球體積（MCV）65 fL，白血球數 5,640/µL，分類正常，血小板數 178,000/µL。這位學生最可能有下列何種疾病？
A. 缺鐵性貧血
B. 輕微型海洋性貧血
C. 慢性疾病引起之貧血
D. 陣發性夜間血色素尿

正確答案：B. 輕微型海洋性貧血